下列何種情形下，抗原呈現細胞可以直接活化CD8+ T細胞？
A. 當抗原呈現細胞表現高量MHC class I時
B. 當樹突細胞表現高量B7與4-1BBL時
C. 當抗原呈現細胞分泌高量IFN-γ時
D. 當病毒不能感染抗原呈現細胞時

正確答案：B. 當樹突細胞表現高量B7與4-1BBL時